Clinical trial inclusion criterion:
Age= 18 and= 75 years

Entity relations:
- Has_value("Age", "= 18 and= 75 years")